Clinical trial inclusion criterion:
Estimated life expectancy of more than 12 weeks

Entity relations:
- Has_value("Estimated life expectancy", "more than 12 weeks")